Clinical trial inclusion criterion:
Sedation and mechanical ventilation planned > 2 days

Annotated entities:
- Procedure: "mechanical ventilation"
- Procedure: "Sedation"
- Temporal: "> 2 days"
- Mood: "planned"